Clinical trial exclusion criterion:
Uncontrolled hypertension (systolic blood pressure> 180 mm Hg. and / or diastolic blood pressure> 100 mm.hg in patients receiving antihypertensive drugs).

Annotated entities:
- Qualifier: "Uncontrolled"
- Condition: "hypertension"
- Measurement: "systolic blood pressure"
- Value: "> 180 mm Hg"
- Measurement: "diastolic blood pressure"
- Value: "> 100 mm.hg"
- Drug: "antihypertensive drugs"